What is the major sequence determinant for nucleosome positioning?

G+C content is the primary determinant of MNase-derived nucleosome occupancy.